Inability or unwillingness to complete questionnaires

The above is a clinical trial exclusion criterion. Annotated with entity spans:
[Observation: Inability] or [Observation: unwillingness to complete questionnaires]